Previous catheter radiofrequency ablation for AF or cardiac surgery;

The above is a clinical trial exclusion criterion. Annotated with entity spans:
Previous [Procedure: catheter radiofrequency ablation] for [Condition: AF] or [Procedure: cardiac surgery];